Severe cardiovascular diseases;

The above is a clinical trial exclusion criterion. Annotated with entity spans:
[Qualifier: Severe] [Condition: cardiovascular diseases];